立克次菌（Rickettsiae）的下列何種性質與病毒相同？
A. 同時有 DNA 和 RNA
B. 細胞內才能生存
C. 行二分法繁殖
D. 可被抗生素殺死

正確答案：B. 細胞內才能生存